Clinical trial exclusion criterion:
1. Personal history of stroke, brain lesions, previous neurosurgery, any personal history of seizure or fainting episode of unknown cause, or head trauma resulting in loss of consciousness, lasting over 30 minutes or with sequela lasting longer than two days.

Annotated entities:
- Parsing_Error: "1."
- Temporal: "history of"
- Condition: "stroke"
- Condition: "brain lesions"
- Condition: "neurosurgery"
- Temporal: "previous"
- Temporal: "personal history of"
- Condition: "seizure"
- Condition: "fainting episode"
- Qualifier: "unknown cause"
- Condition: "head trauma resulting in loss of consciousness"
- Qualifier: "lasting over 30 minutes"
- Condition: "sequela"
- Measurement: "lasting"
- Value: "longer than two days"